Age greater than or equal to 18 years

The above is a clinical trial inclusion criterion. Annotated with entity spans:
[Person: Age] [Value: greater than or equal to 18 years]